Uncontrolled heart failure or NYHA function class III or IV

The above is a clinical trial exclusion criterion. Annotated with entity spans:
[Qualifier: Uncontrolled] [Condition: heart failure] or [Measurement: NYHA function class] [Value: III] or [Value: IV]